Clinical trial inclusion criterion:
male patients with androgenetic alopecia between 18 years and 60 years

Annotated entities:
- Person: "male"
- Condition: "androgenetic alopecia"
- Value: "between 18 years and 60 years"
- Person: "years"